Signed consent form

The above is a clinical trial inclusion criterion. Annotated with entity spans:
[Informed_consent: Signed consent form]